Javier es un adolescente de 16 años, diagnosticado de una enfermedad no curable. ¿Cuál será el comportamiento esperable frente a los demás cuando sea consciente de su propia muerte?:
1. Comportarse igual que lo haría un adulto.
2. Enfadarse con su familia.
3. Rodearse de sus amigos.
4. Permitir ser apoyado y ayudado por su familia.

Respuesta correcta: 4. Permitir ser apoyado y ayudado por su familia.